關於先天性肛門直腸異常（anorectal anomalies），下列何者型態之病患的排便功能預後較佳？
A. 無肛症併直腸尿道瘻管（imperforate anus with rectourethral fistula）
B. 無肛症併直腸陰道瘻管（imperforate auns with rectovaginal fistula）
C. 無肛症併直腸會陰瘻管（imperforate anus with rectoperineal fistula）
D. 泄殖腔畸型（cloacal malformation）

正確答案：C. 無肛症併直腸會陰瘻管（imperforate anus with rectoperineal fistula）